major systemic disease

The above is a clinical trial exclusion criterion. Annotated with entity spans:
[Condition: major systemic disease]